急性下肢動脈完全阻塞疾病，是一種須緊急手術的對象，為避免造成遠端組織的不可逆傷害，最遲在完全阻塞發生之後幾個小時之內要手術治療？
A. 1～2
B. 3～5
C. 6～8
D. 9～12

正確答案：C. 6～8